Clinical trial exclusion criterion:
Patients with documented allergies to propofol, dexmedetomidine, fentanyl, eggs or egg products, or soy or soy products.

Annotated entities:
- Condition: "allergies"
- Drug: "propofol"
- Drug: "dexmedetomidine"
- Drug: "fentanyl"
- Observation: "eggs"
- Observation: "egg products"
- Observation: "soy"
- Observation: "soy products"